下列何者可以在吞噬細胞（phagocytes）內繁殖？
A. 副溶血弧菌（Vibrio parahaemolyticus）
B. 綠膿桿菌（Pseudomonas aeruginosa）
C. 大腸桿菌（Escherichia coli）
D. 退伍軍人肺炎菌（Legionella pneumophila）

正確答案：D. 退伍軍人肺炎菌（Legionella pneumophila）